La cromatografía líquida que emplea fases estacionarias enlazadas puede dividirse en la de fase normal y de fase inversa. En este contexto se puede decir que:
1. El mecanismo de separación principal en fase inversa es el reparto, mientras que la adsorción juega también un papel muy importante en la de fase normal.
2. En la cromatografía de fase normal pueden emplearse gran cantidad de fases estacionarias no polares.
3. El mecanismo de separación principal en fase normal es el reparto, mientras que la adsorción juega un papel muy importante en la de fase inversa.
4. En la cromatografía de fase inversa, la fase estacionaria es polar y los eluyentes no polares.
5. En la cromatografía de fase inversa se pueden emplear gran cantidad de fases estacionarias polares.

Respuesta correcta: 1. El mecanismo de separación principal en fase inversa es el reparto, mientras que la adsorción juega también un papel muy importante en la de fase normal.